Clinical trial inclusion criterion:
The inability to provide informed consent.

Annotated entities:
- Non-query-able: "The inability to provide informed consent."